Previous enrolment in the present study or participation in another clinical study with an investigational product during the last 3 months or as judged by the Investigator.

The above is a clinical trial exclusion criterion. Annotated with entity spans:
[Competing_trial: Previous enrolment in the present study or participation in another clinical study with an investigational product during the last 3 months or as judged by the Investigator.]